Clinical trial exclusion criterion:
Pre-existing renal or hepatic failure

Annotated entities:
- Condition: "hepatic failure"
- Temporal: "Pre-existing"
- Condition: "renal failure"